有關肩難產（shoulder dystocia）的敘述，何者不正確？
A. 巨嬰不一定會發生肩難產
B. 肩難產的母親併發症有產後出血、產道裂傷、和產後感染
C. 肩難產的胎兒併發症有臂神經叢受傷、鎖骨骨折、和腦缺氧
D. 肩難產的發生，因為醫學的進步而減少

正確答案：D. 肩難產的發生，因為醫學的進步而減少